Clinical trial inclusion criterion:
2. History of traumatic brain injury of sufficient severity to have resulted in medical attention (ascertained via the Ohio State University TBI Identification Questionnaire—OSU TBI-ID, and based on DoD/VA criteria)

Annotated entities:
- Condition: "traumatic brain injury"
- Temporal: "History"
- Qualifier: "sufficient severity"
- Subjective_judgement: "sufficient severity"
- Measurement: "Ohio State University TBI Identification Questionnaire—OSU TBI-ID"
- Value: "sufficient severity"